Type 1 diabetes

The above is a clinical trial exclusion criterion. Annotated with entity spans:
[Condition: Type 1 diabetes]